Clinical trial exclusion criteria:
Preoperative renal failure (defined as a serum creatinine > 2.0 mg/dL.)
American Society of Anesthesiologists Physical Status IV or V
Pulmonary disease necessitating home oxygen therapy
Allergy to methadone, hydromorphone, or ketamine
Preoperative recent history of opioid or alcohol abuse
Significant liver disease
Inability to use a PCA device or speak the English language

Annotated entities:
- Temporal: "Preoperative"
- Condition: "renal failure"
- Measurement: "serum creatinine"
- Value: "> 2.0 mg/dL"
- Measurement: "American Society of Anesthesiologists Physical Status"
- Value: "IV or V"
- Condition: "Pulmonary disease"
- Procedure: "home oxygen therapy"
- Drug: "methadone"
- Drug: "hydromorphone"
- Drug: "ketamine"
- Temporal: "Preoperative"
- Temporal: "recent"
- Temporal: "history"
- Condition: "alcohol abuse"
- Condition: "opioid abuse"
- Qualifier: "Significant"
- Condition: "liver disease"
- Device: "PCA device"
- Observation: "Inability to use"
- Observation: "Inability to speak the English language"